Clinical trial exclusion criterion:
Fasting glucose greater 150 mg/dL.

Entity relations:
- Has_value("Fasting glucose", "greater 150 mg/dL")